Clinical trial exclusion criterion:
Patients with a history of allergy or hypersensitivity to tramadol.

Annotated entities:
- Condition: "allergy"
- Condition: "hypersensitivity"
- Drug: "tramadol"